La voltamperometría de redisolución anódica:
1. Se lleva a cabo siempre con electrodos de film de mercurio.
2. Utiliza un proceso de oxidación con agente químicos.
3. Se fundamenta en la formación de sales de mercurio en el electrodo.
4. No necesita de electrolíto de fondo.
5. Tiene una etapa de electrodeposición.

Respuesta correcta: 5. Tiene una etapa de electrodeposición.